下列與手術後併發症相關的敘述，何者錯誤？
A. 輸血反應是手術後發燒的一種原因
B. 肺擴張不全（atelectasis）最常發生於腹部手術後 5～7 天
C. 冠狀動脈疾病（coronary artery disease）、高血壓和年齡的增加是發生手術後心臟衰竭的危險因素
D. 尿滯留（urinary retention）是肛門周圍手術（perianal operations）和疝氣修補術（hernia repair）常見的併發症之一

正確答案：B. 肺擴張不全（atelectasis）最常發生於腹部手術後 5～7 天